Documented untreated ventricular arrhythmia with syncopal episodes within the 3 months.

The above is a clinical trial exclusion criterion. Annotated with entity spans:
Documented [Qualifier: untreated] [Condition: ventricular arrhythmia] with [Condition: syncopal episodes] [Temporal: within the 3 months].